¿Qué posibilidades existen, en cada embarazo, de que unos padres portadores de una mutación en el gen CFTR, tengan un hijo afecto de fibrosis quística?
1. 0,01.
2. 0,1.
3. 0,25.
4. 0,5.
5. 1.

Respuesta correcta: 3. 0,25.